Clinical trial exclusion criterion:
Use of dipyridamole within the last 5 days

Entity relations:
- Has_temporal("dipyridamole", "within the last 5 days")